以下何種處置最無法有效降低疼痛？
A. 用力按壓或搓揉被門縫夾痛的手指頭
B. 在 referred pain 的體表疼痛位置注射局部麻醉劑
C. 根據體表痛處所在位置，在適當的脊髓位置進行 cordotomy，切斷痛處之對側脊髓的 anterolateral pathway
D. 電刺激位於 midbrain 之 periaqueductal gray area

正確答案：B. 在 referred pain 的體表疼痛位置注射局部麻醉劑